下列何種自體抗體與 lupus nephritis 最有相關？
A. Anti-RNP
B. Anti-dsDNA
C. Anti-SS-A/Ro
D. Anti-ribosomal P

正確答案：B. Anti-dsDNA